Clinical trial exclusion criterion:
History of neurologic disease

Entity relations:
- Has_temporal("neurologic disease", "History")